Clinical trial inclusion criterion:
The patients' ECOG scores are =0-2.

Entity relations:
- Has_value("ECOG scores", "=0-2")